Clinical trial exclusion criteria:
1. Patients with other uncontrolled infections (see 2.3.2 for definitions)
2. Patients who received ATG, Campath, or other T cell immunosuppressive monoclonal antibodies in the last 28 days
3. Received donor lymphocyte infusion in last 28 days
4. Diagnosis of Omenn's syndrome or MHC class I deficiency
5. Active and uncontrolled malignancy
6. Pregnant or lactating
7. Unable to wean steroids to ≤0.5 mg/kg/day prednisone.
8. Patients with Grade 3 hyperbilirubinemia

Annotated entities:
- Parsing_Error: "1."
- Condition: "other uncontrolled infections"
- Context_Error: "other uncontrolled infections"
- Undefined_semantics: "other uncontrolled infections"
- Parsing_Error: "2."
- Drug: "ATG"
- Drug: "Campath"
- Drug: "T cell immunosuppressive monoclonal antibodies"
- Temporal: "in the last 28 days"
- Parsing_Error: "3."
- Procedure: "donor lymphocyte infusion"
- Temporal: "in last 28 days"
- Parsing_Error: "4."
- Condition: "Omenn's syndrome"
- Condition: "MHC class I deficiency"
- Parsing_Error: "5."
- Condition: "malignancy"
- Qualifier: "uncontrolled"
- Temporal: "Active"
- Parsing_Error: "6."
- Condition: "Pregnant"
- Condition: "lactating"
- Parsing_Error: "7."
- Drug: "steroids"
- Value: "≤0.5 mg/kg/day"
- Procedure: "wean"
- Drug: "prednisone"
- Negation: "Unable"
- Parsing_Error: "8."
- Condition: "hyperbilirubinemia"
- Qualifier: "Grade 3"